B 型淋巴細胞的抗體基因進行可變區（variable region）重組（recombination），此過程發生於下列那一器官？
A. 胸腺
B. 骨髓
C. 脾臟
D. 腸道淋巴組織

正確答案：B. 骨髓